Neutrophil count: ≥ 1.5 x 109/L

The above is a clinical trial inclusion criterion. Annotated with entity spans:
[Measurement: Neutrophil count]: [Value: ≥ 1.5 x 109/L]